Clinical trial inclusion criterion:
Fasting LDL-C = 250mg/dL at the screening visit

Annotated entities:
- Measurement: "Fasting LDL-C"
- Value: "= 250mg/dL"
- Temporal: "at the screening visit"